Clinical trial inclusion criterion:
Treated by a single NA (lamivudine, adefovir, entecavir or tenofovir) for 6 months to 5 years

Annotated entities:
- Drug: "lamivudine"
- Drug: "adefovir"
- Drug: "entecavir"
- Drug: "tenofovir"
- Multiplier: "single"
- Drug: "NA"
- Procedure: "Treated"
- Temporal: "for 6 months to 5 years"